為了預防新突變種流行性感冒病毒感染，建議老人及兒童每年施打流感疫苗。流感病毒最易發生突變的構造是下列那一項？
A. 紅血球凝集素（hemagglutinin）
B. 反轉錄酶（reverse transcriptase）
C. 轉錄酶（transcriptase）
D. 外套蛋白質（capsid protein）

正確答案：A. 紅血球凝集素（hemagglutinin）